Clinical trial exclusion criterion:
Known liver failure (bilirubin >1.Sx upper limit of normal)

Entity relations:
- Has_value("bilirubin", ">1.Sx upper limit of normal")
- Subsumes("liver failure", "bilirubin")